Subject is a breastfeeding woman.

The above is a clinical trial exclusion criterion. Annotated with entity spans:
[Pregnancy_considerations: Subject is a breastfeeding woman].